¿En cuál de las siguientes infecciones víricas puede presentarse la panencefalitis esclerosante subaguda como una grave complicación de la enfermedad?:
1. Varicela.
2. Sarampión.
3. Herpes simple.
4. Rubeola.

Respuesta correcta: 2. Sarampión.